Able to use independently the device required for treatment by apomorphine

The above is a clinical trial inclusion criterion. Annotated with entity spans:
Able to use independently the [Device: device] required for treatment by [Drug: apomorphine]